Clinical trial inclusion criterion:
Fasting TG<500mg/dL

Annotated entities:
- Measurement: "Fasting TG"
- Value: "<500mg/dL"